免疫球蛋白（immunoglobulin, Ig）的分子結構中，那個區域最具多樣性序列（hyper-variable sequence）？
A. CDR（complementarity-determining region）
B. CL（constant region of light chain）
C. Fc（fragment crystallizable）
D. hinge region

正確答案：A. CDR（complementarity-determining region）